死亡率最高的腦外傷為那一種？
A. 腦挫傷
B. 硬腦膜上出血
C. 急性腦膜下出血
D. 慢性腦膜下出血

正確答案：C. 急性腦膜下出血